一位 68 歲男性，因意識障礙被送至急診室，神經系統檢查發現：兩側瞳孔縮小但對光反射正常，轉頭時出現 doll's eye phenomenon，同時有 Cheyne-Stokes respiration，運動系統功能兩側對稱，無局部癱瘓之現象。造成此患者意識障礙之最可能原因或病灶是：
A. 瀰漫性大腦病變（diffuse encephalopathy）
B. 中腦（midbrain）病變
C. 橋腦（pons）病變
D. 延腦（medulla）病變

正確答案：A. 瀰漫性大腦病變（diffuse encephalopathy）